Clinical trial exclusion criterion:
Stent placement within the previous 6 months

Annotated entities:
- Device: "Stent"
- Procedure: "placement"
- Temporal: "within the previous 6 months"